Clinical trial inclusion criterion:
Age: 18-45 years old

Annotated entities:
- Person: "Age"
- Value: "18-45 years old"